El borohidruro sódico es un reactivo que se utiliza en Química Orgánica por sus propiedades como:
1. Reductor.
2. Oxidante.
3. Alquilante.
4. Ácido.
5. Organometálico.

Respuesta correcta: 1. Reductor.